What does a PET (Positron Excitation Tomography) measure?

Positron Excitation Tomography (PET) is a simple, reliable, and valid method of assessing brain activity in patients with Parkinson's disease (PD).